África es una madre primeriza de un recién nacido a término de 16 horas de vida, al acercarse a valorar una toma observa que el neonato arquea la espalda y se resiste a cogerse al pecho. África afirma que el niño llora en menos de una hora después de haber comido y que la situación le crea ansiedad. Con estos datos, indique el diagnostico de enfermería que presenta:
1. Interrupción de la lactancia materna.
2. Riesgo de alternación de la diada materno/fetal.
3. Lactancia materna ineficaz.
4. Riesgo de proceso de maternidad ineficaz.

Respuesta correcta: 3. Lactancia materna ineficaz.